6. Understand and sign the informed consent form;

The above is a clinical trial inclusion criterion. Annotated with entity spans:
6. [Post-eligibility: Understand and sign the informed consent form;]